Which is the gene mutated in type 1 neurofibromatosis?

NF1 gene, encoding neurofibromin 1